On any thoracic surgery waiting list.

The above is a clinical trial exclusion criterion. Annotated with entity spans:
On any [Observation: thoracic surgery waiting list].